History of clinically significant hypersensitivity or allergic drug reactions

The above is a clinical trial exclusion criterion. Annotated with entity spans:
History of [Qualifier: clinically significant] [Condition: hypersensitivity] or [Condition: allergic drug reactions]